下列何種病原最容易導致急性出血性結膜炎（acute hemorrhagic conjunctivitis）？
A. 單純疱疹病毒（Herpes simplex virus）
B. 腸病毒（Enterovirus）
C. 砂眼披衣菌（Chlamydia trachomatis）
D. 淋球菌（Neisseria gonorrhoeae）

正確答案：B. 腸病毒（Enterovirus）